Clinical trial exclusion criterion:
Pregnant woman

Annotated entities:
- Condition: "Pregnant"
- Person: "woman"